Females must have been surgically sterilized (hysterectomy, bilateral oophorectomy, or bilateral salpingo-oophorectomy; proper documentation required) at least 6 months before screening, or be postmenopausal (defined as 24 consecutive months without menses before screening, with a follicle-stimulating hormone [FSH] level of > 40 IU/L at screening).

The above is a clinical trial inclusion criterion. Annotated with entity spans:
[Person: Females] must have been [Condition: surgically sterilized] ([Procedure: hysterectomy], [Procedure: bilateral oophorectomy], or [Procedure: bilateral salpingo-oophorectomy]; proper documentation required) [Temporal: at least 6 months before] [Reference_point: screening], or be [Condition: postmenopausal] (defined as [Temporal: 24 consecutive months] [Negation: without] [Condition: menses] [Temporal: before screening], with a [Measurement: follicle-stimulating hormone [FSH]] level of [Value: > 40 IU/L] [Temporal: at screening]).